PTSD related to physical or sexual assault

The above is a clinical trial inclusion criterion. Annotated with entity spans:
[Condition: PTSD] related to [Observation: physical] or [Observation: sexual assault]